Clinical trial exclusion criterion:
Abnormal resting ECG

Entity relations:
- Has_value("resting ECG", "Abnormal")